Clinical trial exclusion criterion:
Known platelets < 100.000/µl or known hemorrhagic diathesis

Entity relations:
- OR("platelets", "< 100.000/µl", "hemorrhagic diathesis")